cardiac arrhythmias o;

The above is a clinical trial exclusion criterion. Annotated with entity spans:
[Condition: cardiac arrhythmias] o;